37 歲男子長年酗酒，最近 3 年常噁心嘔吐。某晚喝酒完開始劇烈嘔吐，因大量吐血被送急診室。到達醫院時脈搏增加，血壓下降，醫師檢查發現他的心音規則，心和肺都無雜音，腹部無壓痛或鼓脹，糞便檢查並無潛血反應。下列何者是最符合的診斷？
A. Barrett 食道
B. 食道的鱗狀細胞癌
C. Mallory-Weiss 症候群
D. 食道狹窄

正確答案：C. Mallory-Weiss 症候群